Clinical trial inclusion criterion:
age 18 years or more

Annotated entities:
- Person: "age"
- Value: "18 years or more"